Clinical trial inclusion criterion:
BMI >18 and <35 kg/m2

Entity relations:
- Has_value("BMI", ">18 and <35 kg/m2")